Diagnosis reviewed at transplant center and confirmed to fit the criterion for high risk blood disease or cancer, as defined for the study

The above is a clinical trial inclusion criterion. Annotated with entity spans:
Diagnosis reviewed at transplant center and confirmed to fit the criterion for [Condition: high risk blood disease] or [Condition: cancer], as defined for the study